Clinical trial inclusion criterion:
Patients with T2DM and CAS as defined below:

Annotated entities:
- Condition: "T2DM"
- Condition: "CAS"